Clinical trial inclusion criterion:
Symptomatic paroxysmal AF who had at least one AF episode electrocardiographically documented within one (1) year prior to enrollment. Documentation may include electrocardiogram (ECG); Transtelephonic monitoring (TTM), Holter monitor or telemetry strip

Entity relations:
- Has_index("within one (1) year prior to enrollment", "enrollment")
- Has_qualifier("AF episode", "electrocardiographically documented")
- Subsumes("electrocardiographically documented", "electrocardiographically")
- Has_temporal("AF episode", "within one (1) year prior to enrollment")
- Has_multiplier("AF episode", "at least one")
- Has_qualifier("paroxysmal AF", "Symptomatic")
- OR("electrocardiographically", "Holter monitor", "Transtelephonic monitoring (TTM)", "electrocardiogram (ECG)", "telemetry strip")